Kidney Transplant recipients, after the first episode of cytomegalovirus infection, using the current immunosuppressive regimen: azathioprine or mycophenolate, tacrolimus and prednisone.

The above is a clinical trial inclusion criterion. Annotated with entity spans:
Kidney Transplant recipients, after the first episode of [Condition: cytomegalovirus infection], using the current [Drug: immunosuppressive regimen]: [Drug: azathioprine] or [Drug: mycophenolate], [Drug: tacrolimus] and [Drug: prednisone].